Which is the most mutated gene in dilated cardiomyopathy (DCM)?

Mutations in the lamin A/C gene (LMNA) may cause familial dilated cardiomyopathy (dilated cardiomyopathy)